Mujer de 45 años, con antecedentes de soplo cardiaco detectado en edad pediátrica. Ingresa en el Servicio de Urgencias por cuadro de palpitaciones, cansancio fácil y edemas maleolares. La exploración física pone de manifiesto ausencia de cianosis. Saturación de Oxígeno por pulsioxímetro 97%. TA: 120/80 mm Hg. Ritmo cardiaco irregular a 100 lpm. Soplo sistólico eyección (2/6) en foco pulmonar. 2º R desdoblado, amplio y fijo. No estertores. Ligera hepatomegalia (2-3 cm). Ligeros edemas maleolares. ECG: arritmia completa por fibrilación auricular a 100 lpm. AQRS: +120º. Trastorno de conducción de la rama derecha del haz de His. ¿Cuál es su orientación diagnóstica?
1. Comunicación interventricular.
2. Estenosis aórtica.
3. Estenosis mitral.
4. Comunicación interauricular.
5. Conducto arterioso persistente.

Respuesta correcta: 4. Comunicación interauricular.